下列有關懷孕合併心臟病之敘述，何者錯誤？
A. 懷孕期間應避免心臟衰竭
B. 為避免心臟功能惡化，應行剖腹產
C. 發生心臟衰竭的時間常見於生產時與產後
D. 先天性心臟病孕婦生下有心臟病胎兒的機率較一般孕婦高

正確答案：B. 為避免心臟功能惡化，應行剖腹產